Self reported current or chronic narcotic use (typical daily use)

The above is a clinical trial exclusion criterion. Annotated with entity spans:
[Qualifier: Self reported] [Temporal: current] or [Qualifier: chronic] [Condition: narcotic use] (typical [Multiplier: daily use])